Clinical trial exclusion criterion:
Patients with a body weight < 55 kg (known or estimated)

Annotated entities:
- Measurement: "body weight"
- Value: "< 55 kg"